Active hepatitis virus infection

The above is a clinical trial exclusion criterion. Annotated with entity spans:
[Temporal: Active] [Condition: hepatitis virus infection]